Clinical trial exclusion criterion:
Person falls = once a week due to the reasons that could not be corrected by the new prosthesis (for ex. problems with vestibular system).

Annotated entities:
- Observation: "falls"
- Multiplier: "once a week"
- Non-query-able: "Person falls = once a week due to the reasons that could not be corrected by the new prosthesis (for ex. problems with vestibular system)"